Clinical trial inclusion criterion:
HbA1c (accordingly to IFCC) 47 mmol/mol - 110 mmol/mol.

Entity relations:
- Has_value("HbA1c", "47 mmol/mol - 110 mmol/mol")